某小型臨床試驗評估一個新化療治療淋巴癌的療效，若事實上此新化療有較好的療效，但本研究沒發現顯著的五年存活率差異，無法偵測此新治療效果的原因為何？
A. 檢力（power）太大
B. 抽樣誤差
C. 型一誤差（type I error）
D. 型二誤差（type II error）

正確答案：D. 型二誤差（type II error）